Clinical trial exclusion criterion:
Prior septal surgery

Annotated entities:
- Temporal: "Prior"
- Procedure: "septal surgery"